在呼吸鏈（respiratory chain）中，下列何種 enzyme complex 含有銅離子參與其電子的傳遞？
A. NADH-Q oxidoreductase
B. succinate-Q reductase
C. Q-cytochrome c oxidoreductase
D. cytochrome c oxidase

正確答案：D. cytochrome c oxidase